Clinical trial inclusion criterion:
1. Present for at least 4 weeks

Entity relations:
- Has_temporal("Present", "at least 4 weeks")